Clinical trial exclusion criterion:
Cardiogenic shock of patient with KILLIP III or IV

Annotated entities:
- Condition: "Cardiogenic shock"
- Measurement: "KILLIP"
- Value: "III or IV"